腦梗塞（cerebral infarction）的病因分類中，那一種病因可能與高血壓最不相關？
A. 大血管粥狀動脈硬化性梗塞（large-vessel atherosclerotic infarction）
B. 心臟栓塞（cardiac embolism）
C. 小血管小洞性梗塞（small-vessel lacunar infarction）
D. 血管炎（vasculitis）

正確答案：D. 血管炎（vasculitis）